Clinical trial exclusion criterion:
Insulin treated diabetes

Entity relations:
- multi("Insulin treated", "Insulin")
- Has_qualifier("diabetes", "Insulin treated")